The study will include 40 post-deep peel women (exoderm), older than 18 years old, treated by the same dermatologist (dr. Landau).

The above is a clinical trial inclusion criterion. Annotated with entity spans:
The study will include 40 post-[Condition: deep peel] [Person: women] ([Condition: exoderm]), [Value: older than 18 years] [Person: old], treated by the same dermatologist (dr. Landau).